Clinical trial exclusion criterion:
serious diseases

Entity relations:
- Has_qualifier("diseases", "serious")